Clinical trial inclusion criterion:
2 target vulnerable lesions

Annotated entities:
- Multiplier: "2"
- Condition: "target vulnerable lesions"